Clinical trial exclusion criterion:
Unstable cardiovascular disease with hospitalization within 1 year for acute coronary syndrome

Entity relations:
- Has_temporal("acute coronary syndrome", "within 1 year")
- AND("acute coronary syndrome", "hospitalization")